Clinical trial exclusion criterion:
High risk of bleeding

Entity relations:
- Has_qualifier("bleeding", "High risk")